Clinical trial exclusion criterion:
Person who has a score on 10m walk test less than 3km/h (~0.8m/s) (based on 10m walk test conducted during recruiting).

Entity relations:
- Subsumes("less than 3km/h", "0.8m/s)")
- Has_value("10m walk test", "less than 3km/h")